Clinical trial exclusion criterion:
American Society of Anesthesiologist (ASA) status 4 or higher.

Annotated entities:
- Measurement: "American Society of Anesthesiologist (ASA) status"
- Value: "4 or higher"